What is the mode of inheritance of Acromicric dysplasia?

Acromicric dysplasia has an autosomal dominant mode of inheritance